35 歲女病人腎臟功能在 8 個月內從正常進展到嚴重腎衰竭。追溯她過去使用的多種藥物中發現含有馬兜鈴酸（aristolochic acid）成分。則下列何者最可能代表她腎臟裡面的病理變化？
A. interstitial inflammation with predominant eosinophils
B. crescentic glomerulonephritis
C. acute tubular necrosis
D. interstitial fibrosis with relative paucity of inflammation

正確答案：D. interstitial fibrosis with relative paucity of inflammation